La estimulación vagal del corazón fundamentalmente causa:
1. Bradicardia.
2. Aumento de la velocidad de conducción en el nodo aurículo-ventricular.
3. Aumento de la fuerza contráctil.
4. Aumento del gasto cardiaco.

Respuesta correcta: 1. Bradicardia.